Clinical trial exclusion criterion:
lack of consent

Annotated entities:
- Informed_consent: "lack of consent"